有關髖關節生長性發育不良（developmental dysplasia of the hip）之敘述，下列何者錯誤？
A. 超音波檢查雖然提供更正確的診斷，但身體檢查仍是最主要的診斷方法
B. 利用 Barlow test 可檢查出可被脫位的髖關節
C. 斜頸是危險因子之一， 對有斜頸的新生兒應進行篩檢
D. Ortolani test 以內展（adduction）動作來檢查出髖關節可被脫臼出去

正確答案：D. Ortolani test 以內展（adduction）動作來檢查出髖關節可被脫臼出去